Clinical trial exclusion criterion:
HAs of any kind of moderate or severe intensity on an average of more than 2 days per month preceding the concussive trauma

Annotated entities:
- Condition: "HAs"
- Qualifier: "moderate or severe intensity"
- Multiplier: "average of more than 2 days per month"
- Temporal: "preceding the concussive trauma"